有關風濕免疫疾病合併眼病變，下列何種組合最正確？
A. 類風濕性關節炎合併葡萄膜炎（uveitis）及全身性紅斑性狼瘡（SLE）合併眼視網膜病變
B. 類風濕性關節炎合併鞏膜炎（scleritis）及原發性膽道硬化症合併乾燥症（Sjögren's syndrome）
C. 僵直性脊椎炎合併後房葡萄膜炎（posterior uveitis）及 SLE 合併視網膜病變
D. 乾癬性關節炎合併鞏膜炎及僵直性脊椎炎合併前房葡萄膜炎（anterior uveitis）

正確答案：B. 類風濕性關節炎合併鞏膜炎（scleritis）及原發性膽道硬化症合併乾燥症（Sjögren's syndrome）